Diagnosed Iron deficiency anemia.

The above is a clinical trial inclusion criterion. Annotated with entity spans:
Diagnosed [Condition: Iron deficiency anemia].